What is Trypan blue used for?

Trypan blue is used in the "trypan blue exclusion assay" for assessing cell viability/cell death.